BMI < 40;

The above is a clinical trial inclusion criterion. Annotated with entity spans:
[Measurement: BMI] [Value: < 40];